心肌梗塞發生多久時，在顯微變化上明顯出現大量嗜中性白血球？
A. 1-3 小時
B. 6-12 小時
C. 12-18 小時
D. 1-3 天

正確答案：D. 1-3 天